Clinical trial exclusion criterion:
Allergy to the used local anesthetics

Annotated entities:
- Condition: "Allergy"
- Drug: "local anesthetics"